history of renal diseases, a coagulation abnormality, a hepatic disease, or drug abuse

The above is a clinical trial exclusion criterion. Annotated with entity spans:
[Temporal: history] of [Condition: renal diseases], a [Condition: coagulation abnormality], a [Condition: hepatic disease], or [Condition: drug abuse]